有關傷口感染之描述，下列何者錯誤？
A. 傷口感染的病因包括細菌因素，局部傷口因素，病人因素
B. 清潔傷口術後產生感染的機率為百分之三以下
C. 預防性抗生素乃使用於清潔傷口之手術
D. 正常人發生外傷時，每公克組織上的細菌數目大於105個才會造成感染

正確答案：C. 預防性抗生素乃使用於清潔傷口之手術